65 歲女性病患因大量腹水住院，其腹水檢查結果如下：顏色：乳白色；albumin 3.0 g/dL； 5 g/dL。下列何者是最可能的診斷？
A. cirrhosis
B. neoplasm
C. pyogenic peritonitis
D. nephrosis

正確答案：B. neoplasm